下列何種寄生蟲的成蟲及蟲卵均可到達病人腦部，造成病變？
A. 異形異形吸蟲（Heterophyes heterophyes）
B. 日本血吸蟲（Schistosoma japonicum）
C. 中華肝吸蟲（Clonorchis sinensis）
D. 牛羊肝吸蟲（Fasciola hepatica）

正確答案：B. 日本血吸蟲（Schistosoma japonicum）